Clinical trial inclusion criteria:
Patients undergoing small bowel video capsule endoscopy

Annotated entities:
- Procedure: "small bowel video capsule endoscopy"